T 細胞受體之 β 鏈（T cell receptor β-chain, TCRβ）基因之胚原序列（germline sequence）可存在於下列那種細胞中？
A. CD4+CD8+ T 細胞
B. 輔助型 T 細胞（helper T cell）
C. 毒殺型 T 細胞（cytotoxic T cell）
D. B 細胞

正確答案：D. B 細胞